Clinical trial inclusion criterion:
Patients undergoing surgeries in the upper limb (arm, forearm or hand)

Entity relations:
- Subsumes("upper limb", "arm")
- Has_qualifier("surgeries", "upper limb")
- OR("arm", "forearm", "hand")